Clinical trial inclusion criterion:
MCI (MoCA >18<26 -inclusive of 1 point if <12 years of education Group 2

Annotated entities:
- Condition: "MCI"
- Measurement: "MoCA"
- Value: ">18<26"
- Non-representable: "-inclusive of 1 point if <12 years of education Group 2"